Clinical trial inclusion criterion:
Viral load ≥10000UI/mL.

Entity relations:
- Has_value("Viral load", "≥10000UI/mL")